What is Morton's Neuroma?

Morton's neuromas are abnormalities of the common digital nerve branch located between the lesser metatarsal heads and is a common cause of foot pain.